Clinical trial inclusion criterion:
Residual alveolar width = 4 mm (Milinkovic and Cordaro, 2014), residual alveolar height >8 mm, enough inter-arch space for a crown (at least 5 mm) and a minimum distance of 7 mm from the adjacent teeth (Shah and Lum, 2008). The width and height will be confirmed after x-ray examination in Visit 2.

Annotated entities:
- Measurement: "Residual alveolar width"
- Value: "= 4 mm"
- Measurement: "residual alveolar height"
- Value: ">8 mm"
- Non-query-able: "enough inter-arch space for a crown (at least 5 mm) and a minimum distance of 7 mm from the adjacent teeth (Shah and Lum, 2008). The width and height will be confirmed after x-ray examination in Visit 2"